Clinical trial exclusion criterion:
9. Patients with clinically significant medical conditions as determined by the investigator including renal, hepatic, hematologic, neurologic or immune disease. Examples include but are not limited to:

Annotated entities:
- Parsing_Error: "9."
- Condition: "medical conditions"
- Qualifier: "clinically significant"
- Observation: "as determined by the investigator"
- Subjective_judgement: "as determined by the investigator"
- Condition: "renal disease"
- Condition: "immune disease"
- Condition: "hepatic disease"
- Condition: "hematologic disease"
- Condition: "neurologic disease"
- Parsing_Error: "Examples include but are not limited to:"